陳先生今年75歲，是原住民，發生左側硬腦膜下出血併腦幹壓迫，在順利接受血塊移除手術後被送到加護病房觀察。術後第3天醒來，第5天順利拔管後，他看起來焦慮，說	聽不懂的話語，不斷地想下床。當班的外科醫師應該如何處置？
A. 開顱手術術後病人本來就會神智不清，給予手腳約束，維護病人安全，免得陳先生亂拔管路
B. 為了讓護理師比較好照顧，給予鎮靜劑讓陳先生不要那麼躁動
C. 先請懂得原住民話語的同鄉或家屬聽聽說話的內容，試圖了解他的需求
D. 陳先生此時應該算無行為能力，做必要的醫療處置如更換中央靜脈導管前不需要和他溝通

正確答案：C. 先請懂得原住民話語的同鄉或家屬聽聽說話的內容，試圖了解他的需求